aged 3-9 years

The above is a clinical trial inclusion criterion. Annotated with entity spans:
[Person: aged] [Value: 3-9 years]